下列何者最不會影響血紅素（hemoglobin）的氧飽和度 ？
A. 氧分壓
B. 溫度
C. 酸鹼值
D. 細胞激素

正確答案：D. 細胞激素